Receiving antimicrobial therapy to treat non-tuberculous mycobacterium (e.g., M. abscessus, M. avium complex) in the two weeks prior to Visit 2

The above is a clinical trial exclusion criterion. Annotated with entity spans:
Receiving [Drug: antimicrobial therapy] to treat [Qualifier: non-tuberculous mycobacterium] (e.g., [Qualifier: M. abscessus], [Qualifier: M. avium complex]) [Temporal: in the two weeks prior to Visit 2]